Clinical trial exclusion criteria:
Formal indication to oral anticoagulation beside atrial fibrillation (mechanic heart valves, recurrent thrombophlebitis, antiphospholipid syndrome)
Life expectancy < 6 months (e.g., terminal cancer)
Live donor transplantation scheduled within 6 months
Pregnancy (ß-HCG blood-based assay)or nursing (lactating) women
Women of child bearing potential, unless they are using an effective method of birth control
Patient under legal guardianship
Patients under law protection
Known hypersensibility to coumadin or indoine derivatives or to any excipients (CI to oral AVK)
Severe liver failure (CI to oral AVK)

Annotated entities:
- Condition: "indication"
- Drug: "oral anticoagulation"
- Condition: "atrial fibrillation"
- Device: "mechanic heart valves"
- Condition: "recurrent thrombophlebitis"
- Condition: "antiphospholipid syndrome"
- Observation: "Life expectancy"
- Value: "< 6 months"
- Condition: "terminal cancer"
- Procedure: "Live donor transplantation"
- Temporal: "within 6 months"
- Mood: "scheduled"
- Pregnancy_considerations: "Pregnancy (ß-HCG blood-based assay)or nursing (lactating) women"
- Pregnancy_considerations: "Women of child bearing potential, unless they are using an effective method of birth control"
- Non-query-able: "Patient under legal guardianship"
- Non-query-able: "Patients under law protection"
- Condition: "hypersensibility"
- Drug: "coumadin"
- Drug: "indoine"
- Condition: "liver failure"
- Qualifier: "Severe"